Clinical trial exclusion criterion:
taking medicine within one month.

Entity relations:
- Has_qualifier("medicine", "within one month")